Niño de 1 año de edad, que no pasó las pruebas de cribado auditivo al nacimiento y que presenta unos potenciales evocados auditivos del tronco cerebral que determinan una hipoacusia bilateral leve-moderada en el oído derecho y moderada-grave en el oído izquierdo. ¿Cuál es la actitud más correcta a seguir en el momento actual?
1. Realizar una audiometría en el plazo de 6 meses para confirmar el diagnóstico.
2. Cirugía para adaptar un implante coclear en el oído derecho.
3. Esperar hasta los 3 años para comprobar si desarrolla el lenguaje.
4. Adaptación de audioprótesis bilateral y rehabilitación logopédica.
5. Cirugía para adaptar un implante coclear en el oído izquierdo.

Respuesta correcta: 4. Adaptación de audioprótesis bilateral y rehabilitación logopédica.